Physician-led sedation (if sedated; as opposed to nurse-led protocol)

The above is a clinical trial inclusion criterion. Annotated with entity spans:
[Qualifier: Physician-led] [Procedure: sedation] (if sedated; [Negation: as opposed to] [Qualifier: nurse-led protocol])